下列何者不是抗流感病毒藥物？
A. Acyclovir（Zovirax(r)）
B. Oseltamivir（Tamiflu(r)）
C. Peramivir（Rapiacta(r)）
D. Zanamivir（Relenza(r)）

正確答案：A. Acyclovir（Zovirax(r)）